Clinical trial inclusion criterion:
BMI < 45kg/m2

Annotated entities:
- Measurement: "BMI"
- Value: "< 45kg/m2"